Clinical trial inclusion criterion:
History of a solitary renal transplant

Entity relations:
- Has_qualifier("renal transplant", "solitary")